HAMA score=17

The above is a clinical trial inclusion criterion. Annotated with entity spans:
[Measurement: HAMA score][Value: =17]